Clinical trial inclusion criterion:
Translocation t(9;22) [BCR/ABL+] (Philadelphia chromosome-positive) or t(4;11) [MLL/AF4+].

Annotated entities:
- Line: "Translocation t(9;22) [BCR/ABL+] (Philadelphia chromosome-positive) or t(4;11) [MLL/AF4+]"
- Measurement: "Translocation t(9;22)"
- Measurement: "BCR/ABL"
- Value: "+"
- Measurement: "Philadelphia chromosome"
- Value: "positive"
- Measurement: "t(4;11)"
- Measurement: "MLL/AF4"
- Value: "+"